Patients aged from 18 to 65 years old.

The above is a clinical trial inclusion criterion. Annotated with entity spans:
Patients [Person: aged] [Value: from 18 to 65 years old].